Clinical trial exclusion criterion:
addiction to alcohol or recreational drugs

Entity relations:
- OR("addiction to alcohol", "addiction to recreational drugs")